¿Cuál de las siguientes afirmaciones es FALSA respecto a la estadificación del cáncer de páncreas?
1. La estadificación local puede realizarse con RM y TC.
2. La invasión tumoral arterial es un criterio de irresecabilidad.
3. La infiltración focal de la vena mesentérica superior no es una contraindicación a la cirugía.
4. La biopsia preoperatoria de los tumores pancreáticos es habitualmente necesaria para decidir el tratamiento quirúrgico.

Respuesta correcta: 4. La biopsia preoperatoria de los tumores pancreáticos es habitualmente necesaria para decidir el tratamiento quirúrgico.